Clinical trial exclusion criterion:
Subjects were not to use any prescription medication within 14 days prior to or during the study.

Entity relations:
- Has_negation("prescription medication", "not")
- Has_temporal("prescription medication", "within 14 days prior to the study")
- OR("within 14 days prior to the study", "during the study")